echocardiographic structural (a left atrial volume index > 34 mL/m2 or a left ventricular mass index =115 g/m2 for males and =95 g/m2 for females) or functional alterations (E/e'=13 and a mean e' septal and lateral wall < 9 cm/s).

The above is a clinical trial inclusion criterion. Annotated with entity spans:
[Measurement: echocardiographic structural] (a [Measurement: left atrial volume inde]x [Value: > 34 mL/m2] or a [Measurement: left ventricular mass index] [Value: =115 g/m2] for [Person: males] and [Value: =95 g/m2] for [Person: females]) or [Measurement: functional alterations] ([Measurement: E/e'][Value: =13] and a [Measurement: mean e' septal and lateral wall] [Value: < 9 cm/s]).